Clinical trial exclusion criterion:
Current use of medication that may affect voiding (ie- anticholinergics)

Entity relations:
- Has_temporal("medication", "Current")
- Subsumes("medication", "anticholinergics")
- AND("medication", "affect voiding")